or they are receiving regular physical rehabilitation at present;

The above is a clinical trial exclusion criterion. Annotated with entity spans:
or they are receiving [Procedure: regular physical rehabilitation] [Temporal: at present];